El intervalo QT del electrocardiograma indica la duración de la:
1. Contracción auricular.
2. Contracción ventricular.
3. Relajación ventricular.
4. Relajación auricular.
5. Retraso en el nodo aurículo-ventricular.

Respuesta correcta: 2. Contracción ventricular.